當一個研究者結論未能偵測出顯著的效應，下列何者的誤差和研究者的結論有關聯？
A. 因為樣本數太小，此結論錯誤的可能性很低
B. 犯下第二誤差的可能性很小
C. 第一誤差的機率大於 0.05
D. 犯下第二誤差的可能性很大

正確答案：D. 犯下第二誤差的可能性很大